Clinical trial inclusion criterion:
no previous treatment

Annotated entities:
- Negation: "no"
- Temporal: "previous"
- Procedure: "treatment"
- Context_Error: "no previous treatment"